Creatinine clearance (CrCl) greater than or equal to 60 mL/min, either measured or estimated by Cockcroft-Gault equation. NOTE: A calculator for estimating the CrCl can be found at www.fstrf.org/ACTG/ccc.html

The above is a clinical trial inclusion criterion. Annotated with entity spans:
[Measurement: Creatinine clearance (CrCl)] [Value: greater than or equal to 60 mL/min], either measured or estimated by [Procedure: Cockcroft-Gault equation]. NOTE: A calculator for estimating the CrCl can be found at www.fstrf.org/ACTG/ccc.html